下列何者並非口服避孕藥（oral contraceptive pills）之絕對禁忌症？
A. 原因尚不明之陰道出血
B. 長期每天抽2包菸的40歲女性
C. 過去健檢時肝指數曾經稍高，後續門診追蹤皆正常，也無肝臟疾病
D. 過去曾有肺栓塞

正確答案：C. 過去健檢時肝指數曾經稍高，後續門診追蹤皆正常，也無肝臟疾病